Congenital urogenital anomaly

The above is a clinical trial exclusion criterion. Annotated with entity spans:
[Qualifier: Congenital] [Condition: urogenital anomaly]